Clinical trial exclusion criterion:
Clinically significant (> 4 Tablespoons per day) sputum production

Entity relations:
- Subsumes("Clinically significant", "> 4 Tablespoons per day")
- Has_qualifier("sputum production", "Clinically significant")